Oral corticosteroids at a dose >40 mg prednisone or its equivalent per day; receipt of cyclosporine, tacrolimus, sirolimus, or mycophenolate mofetil within 8 weeks before the first study agent injection; or use of an investigational agent within 5 half-lives of that agent before the first study agent injection.

The above is a clinical trial exclusion criterion. Annotated with entity spans:
[Drug: Oral corticosteroids] at a dose [Multiplier: >40 mg prednisone] or its equivalent per day; receipt of [Drug: cyclosporine], [Drug: tacrolimus], [Drug: sirolimus], or [Drug: mycophenolate mofetil] [Temporal: within 8 weeks before the first study agent injection]; or use of an [Drug: investigational agent] [Temporal: within 5 half-lives] of that agent [Temporal: before the first study agent injection].